Younger than 18 years of age

The above is a clinical trial exclusion criterion. Annotated with entity spans:
[Value: Younger than 18 years] of [Person: age]